anticipation of a required drug test in the 4 weeks following the study.

The above is a clinical trial exclusion criterion. Annotated with entity spans:
[Mood: anticipation of] a required [Procedure: drug test] [Temporal: in the 4 weeks following the study].